patients with hypovolemic shock;

The above is a clinical trial exclusion criterion. Annotated with entity spans:
patients with [Condition: hypovolemic shock];